Epilepsy partial seizure subjects.

The above is a clinical trial inclusion criterion. Annotated with entity spans:
[Condition: Epilepsy] [Condition: partial seizure] subjects.